有關糖皮質激素-受體複合物（glucocorticoid-receptor complex）影響轉錄的敘述，下列何者錯誤？
A. 主要是與其它轉錄因子（transcription factor）結合，進而抑制基因表現
B. 激素-受體複合物是在細胞內形成
C. 結合在它們可辨識的DNA序列上來影響激素反應基因（hormone responsive gene）的轉錄
D. 受體具有典型的DNA結合區域（DNA-binding domain），與激素結合區域（hormone binding domain）不同

正確答案：A. 主要是與其它轉錄因子（transcription factor）結合，進而抑制基因表現